Clinical trial exclusion criterion:
American Society of Anesthesiologist (ASA) status 4 or higher.

Entity relations:
- Has_value("American Society of Anesthesiologist (ASA) status", "4 or higher")